下列何者不是副交感神經核？
A. 上唾液核（superior salivatory nucleus）
B. 迷走神經背運動核（dorsal motor nucleus of vagus nerve）
C. 三叉神經運動核（trigeminal motor nucleus）
D. Edinger-Westphal nucleus

正確答案：C. 三叉神經運動核（trigeminal motor nucleus）